Clinical trial exclusion criterion:
Factors that could have an effect on oral medication (such as inability to swallow, chronic diarrhea and intestinal obstruction);

Entity relations:
- OR("inability to swallow", "chronic diarrhea", "intestinal obstruction")